Clinical trial exclusion criterion:
Any abnormality of the cornea which may prevent reliable applanation tonometry

Entity relations:
- Has_qualifier("abnormality", "cornea")